What is PNPPP?

personally normalized plasma protein profiles (PNPPP)